Clinical trial exclusion criterion:
positive drug screen at the time of delivery

Entity relations:
- Has_index("at the time of delivery", "the time of delivery")
- multi("the time of delivery", "delivery")
- Has_value("drug screen", "positive")
- Has_temporal("drug screen", "at the time of delivery")